What is the role of TNF in obesity?

TNFalpha gene overexpression induces insulin resistance. TNF-alpha is associated with obesity